一位28歲產婦進行剖腹產，接受硬脊膜外麻醉。給予15 mL 2% lidocaine後，產婦覺得有點舌頭麻麻、頭暈現象。則下列何者正確：
A. 硬脊膜外麻醉藥物的區域麻醉範圍過高
B. 局部麻醉藥物被血管吸收產生
C. 靜脈注射血管升壓劑可改善此現象
D. 左側斜躺可改善

正確答案：B. 局部麻醉藥物被血管吸收產生